下列何種血管舒張劑可經由抑制 phosphodiesterase 5 而用於治療陽萎？
A. enalapril
B. vardenafil
C. minoxidil
D. nitroglycerin

正確答案：B. vardenafil